Clinical trial exclusion criterion:
contraindication to the study drug

Entity relations:
- AND("contraindication", "study drug")